¿Cuál de las siguientes afirmaciones es correcta respecto a la epidemiología de los trastornos del estado de ánimo?:
1. Los trastornos bipolares suponen el 25-30% del conjunto de los trastornos del estado de ánimo.
2. La duración media de un episodio depresivo suele ser de unos 2-3 meses.
3. El porcentaje de recaídas de depresión a lo largo de la vida se estima en un 75%.
4. El riesgo de suicidio en el trastorno depresivo es mayor al trastorno bipolar.
5. Se halla un 50% o más de historia de trastorno bipolar en las familias de pacientes con depresión.

Respuesta correcta: 3. El porcentaje de recaídas de depresión a lo largo de la vida se estima en un 75%.